Clinical trial inclusion criterion:
The study will include 40 post-deep peel women (exoderm), older than 18 years old, treated by the same dermatologist (dr. Landau).

Annotated entities:
- Condition: "deep peel"
- Person: "women"
- Condition: "exoderm"
- Value: "older than 18 years"
- Person: "old"